El genoma mitocondrial:
1. Es circular.
2. Es de hebra simple.
3. Codifica todas las proteínas mitocondriales.
4. Forma parte del ADN nuclear.
5. Ninguna de las anteriores.

Respuesta correcta: 1. Es circular.